Clinical trial inclusion criterion:
Viral load < 200 copies

Entity relations:
- Has_value("Viral load", "< 200 copies")